Clinical trial exclusion criteria:
Previous anaphylaxis following any component of Bexsero vaccine
Previous receipt of meningococcal B vaccine (Bexsero)
Known pregnancy

Annotated entities:
- Condition: "anaphylaxis"
- Temporal: "Previous"
- Drug: "Bexsero vaccine"
- Temporal: "Previous"
- Drug: "meningococcal B vaccine"
- Drug: "Bexsero"
- Condition: "pregnancy"